5. Estimated IQ greater than or equal to 85

The above is a clinical trial inclusion criterion. Annotated with entity spans:
[Parsing_Error: 5.] [Measurement: Estimated IQ] [Value: greater than or equal to 85]